Clinical trial exclusion criterion:
Previous treatment for glucose

Entity relations:
- Has_temporal("treatment for glucose", "Previous")